Clinical trial exclusion criteria:
Patients with intercurrent infections.
Patients with sepsis.
Patients receiving drugs affecting immune system like immunosuppressive drugs.
Patients on antibiotics.

Annotated entities:
- Condition: "intercurrent infections"
- Condition: "sepsis"
- Drug: "drugs affecting immune system"
- Drug: "immunosuppressive drugs"
- Drug: "antibiotics"